En un estudio de cruzamiento de prueba de tres puntos, una interferencia negativa indica que:
1. Se han producido más entrecruzamientos dobles de lo que se esperaba.
2. Se han producido menos entrecruzamientos dobles de lo que se esperaba.
3. El coeficiente de coincidencia es menor que 1.
4. Un entrecruzamiento simple disminuye la probabilidad de que ocurra uno doble.
5. Se han producido menos entrecruzamientos simples de lo que se esperaba.

Respuesta correcta: 1. Se han producido más entrecruzamientos dobles de lo que se esperaba.